Clinical trial exclusion criterion:
Major surgical procedure or significant traumatic injury within approximately 28 days prior to randomization or anticipation of the need for major surgery during the course of study treatment.

Annotated entities:
- Qualifier: "Major"
- Procedure: "surgical procedure"
- Qualifier: "significant"
- Condition: "traumatic injury"
- Temporal: "within approximately 28 days prior to randomization"
- Reference_point: "randomization"
- Mood: "anticipation of the need"
- Procedure: "major surgery"
- Temporal: "during the course of study treatment"
- Reference_point: "study treatment"
- Procedure: "treatment"